¿En qué consiste el tratamiento de la insuficiencia suprarrenal crónica primaria? :
1. En la administración de un antagonista de los receptores de aldosterona.
2. En la extirpación de la glándula afectada.
3. En la administración conjunta de un glucocorticoide y un análogo de aldosterona.
4. En administrar un glucocorticoide de elevada potencia en días alternos.

Respuesta correcta: 3. En la administración conjunta de un glucocorticoide y un análogo de aldosterona.